Clinical trial exclusion criterion:
serious bleeding during the course of the ulcer

Annotated entities:
- Qualifier: "serious"
- Condition: "bleeding"
- Temporal: "during the course of the ulcer"